3. Women with abnormally high liver enzymes or liver disease. (ALT or AST exceeding 2.0 x ULN AND total bilirubin exceeding 1.5 x ULN at screening and confirmed on repeat).

The above is a clinical trial exclusion criterion. Annotated with entity spans:
[Parsing_Error: 3.] [Person: Women] with abnormally [Value: high] [Measurement: liver enzymes] or [Condition: liver disease]. ([Measurement: ALT] or [Measurement: AST] [Value: exceeding 2.0 x ULN] AND [Measurement: total bilirubin] [Value: exceeding 1.5 x ULN] [Temporal: at screening] and confirmed on repeat).